下列有關平滑肌細胞（smooth muscle cell）的敘述，何項正確？
A. 緻密體（dense body）可供肌球蛋白絲（myosin filament）直接附
B. 細胞外有外板（external lamina）包圍
C. 細胞內藉由T小管（T tubule）傳遞鈣離子
D. 細胞之間藉由橋粒（desmosome）連接

正確答案：B. 細胞外有外板（external lamina）包圍